Clinical trial exclusion criterion:
Trauma or extensive surgery within 1 month before randomization or surgery planned in the next 6 months after randomization.

Entity relations:
- Has_temporal("Trauma", "within 1 month before randomization")
- Has_temporal("surgery", "in the next 6 months after randomization")
- Has_mood("surgery", "planned")
- OR("Trauma", "extensive surgery")
- OR("Trauma", "surgery")